Clinical trial exclusion criterion:
Hypersensitivity to, or disability to take immunosuppressive drugs.

Annotated entities:
- Condition: "Hypersensitivity"
- Condition: "disability"
- Drug: "immunosuppressive drugs"